Clinical trial exclusion criterion:
Proteinuria > 0,5 g/l;

Entity relations:
- Has_multiplier("Proteinuria", "> 0,5 g/l")